一位53歲男性，以往健康良好，最近逐漸出現黃疸症狀，糞便呈淺色，尿液茶褐色。病患以往沒有膽道結石病史。理學檢查顯示患者腹部無痛覺，沒有硬塊，膽囊亦觸摸不到。實	室血液數據顯示總膽管色素：9.8 mg/dL，直接膽紅素：7.6 mg/dL， prothrombin time INR：1.79，ALT：141 U/L，AST：147 U/L，澱粉酶：130 U/L，脂肪酶：86 U/L，alkaline-P：469 U/L。 腹部超音波顯示肝內肝管擴大，膽囊正常。則下列何者與病患最可能的疾病診斷不符？
A. 腹部電腦斷層顯示總膽管明顯擴大
B. 病患的腫瘤為腺癌，生長速度緩慢
C. 膽道感染不常見
D. 經皮穿肝膽道攝影比內視鏡逆行性膽道攝影的診斷價值為高

正確答案：A. 腹部電腦斷層顯示總膽管明顯擴大